Clinical trial inclusion criterion:
Ages=65 years,Not limited to gender.

Entity relations:
- Has_value("Ages", "=65 years")